Clinical trial inclusion criterion:
The patients are non-pregnant, and disposed to practice contraception during the whole trial.

Annotated entities:
- Pregnancy_considerations: "The patients are non-pregnant, and disposed to practice contraception during the whole trial."